Clinical trial exclusion criterion:
Primary diagnosis of MDD with psychotic feature, bipolar disorder, schizophrenia, schizoaffective disorder, other psychotic disorder or anxiety disorder, a history of alcohol/ drug abuse within the past 12 months, or a diagnosis of dementia

Entity relations:
- Has_qualifier("psychotic disorder", "other")
- Has_temporal("alcohol abuse", "within the past 12 months")
- AND("MDD", "psychotic feature")
- AND("psychotic feature", "bipolar disorder")
- AND("psychotic feature", "schizophrenia")
- AND("psychotic feature", "schizoaffective disorder")
- AND("psychotic feature", "psychotic disorder")
- AND("psychotic feature", "other")
- OR("MDD", "bipolar disorder", "schizophrenia", "schizoaffective disorder", "psychotic disorder", "anxiety disorder,", "alcohol abuse", "dementia", "psychotic feature")
- OR("alcohol abuse", "drug abuse")